Clinical trial exclusion criterion:
Patients who have a contraindication to two or more of the three study prophylaxis regimens;

Annotated entities:
- Condition: "contraindication"
- Non-representable: "Patients who have a contraindication to two or more of the three study prophylaxis regimens"